What does gepotidacin do to bacteria?

Gepotidacin inhibits bacterial DNA replication.